Age= 18 and= 75 years

The above is a clinical trial inclusion criterion. Annotated with entity spans:
[Person: Age][Value: = 18 and= 75 years]